Clinical trial exclusion criterion:
Past or planned surgery affecting gastric acid secretion.

Entity relations:
- Has_qualifier("surgery", "affecting gastric acid secretion")
- Has_mood("surgery", "planned")
- Has_temporal("surgery", "Past")